下列那一種病毒不具有血球凝集素（hemagglutinin）？
A. 流行性感冒病毒（influenza viruses）
B. 呼吸道融合病毒（respiratory syncytial viruses）
C. 腮腺炎病毒（mumps viruses）
D. 麻疹病毒（measles viruses）

正確答案：B. 呼吸道融合病毒（respiratory syncytial viruses）